Clinical trial exclusion criterion:
20. Examinations (physical examination, X-ray examination, type-B ultrasonic detection or other methods) reveal that the subject has malignant mass, gland hyperplasia or adenoma with endocrine activity, or impact on heart, or endocrine function (such as pheochromocytoma, thyroid enlargement);

Entity relations:
- Subsumes("Examinations", "physical examination")
- AND("with endocrine activity", "endocrine activity")
- Has_qualifier("adenoma", "with endocrine activity")
- Subsumes("impact on heart", "pheochromocytoma")
- AND("Examinations", "malignant mass")
- OR("physical examination", "type-B ultrasonic detection", "X-ray examination", "other methods")
- OR("malignant mass", "gland hyperplasia", "endocrine activity", "impact on heart", "adenoma")
- OR("pheochromocytoma", "thyroid enlargement")
- OR("impact on heart", "impact on endocrine function")